一位83歲男性，有認知能力退化現象，與女兒同住。被女兒送至急診室，他看起來營養狀況不良，身體可聞到尿味，兩上臂有瘀青現象，左手腕有擦傷。看起來有害怕的眼神，但他否認有任何人傷害他。急診室醫師在診療病人後首先應採取的作為，下列何者最適當？
A. 告訴他女兒，病人可能被虐待
B. 儘快請他女兒將病人帶回家
C. 聯絡社工來協助處理
D. 安排尿液檢查

正確答案：C. 聯絡社工來協助處理